Clinical trial exclusion criterion:
Radiographic signs of osteoarthritis (> Tonis grade 1)

Entity relations:
- Has_mood("osteoarthritis", "Radiographic signs")
- multi("Radiographic signs", "Radiographic")
- Has_value("Tonis grade", "> 1")
- AND("osteoarthritis", "Tonis grade")